Clinical trial inclusion criterion:
Histological confirmation of relapsed/refractory diffuse large B-cell lymphoma after prior rituximab and anthracycline-containing systemic treatment regimen such as R-CHOP (rituximab, cyclophosphamide, doxorubicin, vincristine, and prednisone), R-EPOCH (rituximab, etoposide phosphate, prednisone, vincristine sulfate, cyclophosphamide, doxorubicin hydrochloride), R-HyperCVAD (rituximab, cyclophosphamide, vincristine sulfate, doxorubicin hydrochloride, dexamethasone) etc.

Entity relations:
- Has_qualifier("B-cell lymphoma", "large")
- Has_qualifier("B-cell lymphoma", "diffuse")
- Subsumes("R-CHOP", "rituximab")
- Subsumes("R-EPOCH", "rituximab")
- AND("R-HyperCVAD", "rituximab")
- Has_value("Histological", "confirmation")
- Subsumes("rituximab and anthracycline-containing systemic treatment regimen", "R-CHOP")
- Has_index("after", "prior rituximab and anthracycline-containing systemic treatment regimen")
- Has_temporal("Histological", "after")
- AND("Histological", "B-cell lymphoma")
- Subsumes("R-CHOP", "cyclophosphamide")
- Subsumes("R-CHOP", "doxorubicin")
- Subsumes("R-CHOP", "vincristine")
- Subsumes("R-CHOP", "prednisone")
- Subsumes("R-EPOCH", "etoposide phosphate")
- Subsumes("R-EPOCH", "prednisone")
- Subsumes("R-EPOCH", "vincristine sulfate")
- Subsumes("R-EPOCH", "cyclophosphamide")
- Subsumes("R-EPOCH", "doxorubicin hydrochloride")
- AND("R-HyperCVAD", "cyclophosphamide")
- AND("R-HyperCVAD", "vincristine sulfate")
- AND("R-HyperCVAD", "doxorubicin hydrochloride")
- AND("R-HyperCVAD", "dexamethasone")
- Subsumes("rituximab and anthracycline-containing systemic treatment regimen", "R-EPOCH")
- Subsumes("rituximab and anthracycline-containing systemic treatment regimen", "R-HyperCVAD")